Clinical trial exclusion criterion:
Use of opioids or neuropathic analgesics

Entity relations:
- OR("opioids", "neuropathic analgesics")